下列有關疹病毒（Herpesvirus）之敘述，何者錯誤？
A. 雙股 DNA 病毒
B. 唇部疹（cold sore）主要由第一型單純疹病毒（HSV-1）所引起
C. 病毒感染後，病人痊癒，終生免疫，不再犯病
D. 人類疹病毒第八型（HHV-8）感染產生卡波西氏肉瘤（Kaposi's sarcoma）

正確答案：C. 病毒感染後，病人痊癒，終生免疫，不再犯病